Clinical trial inclusion criterion:
4. MMSE score ≥ 20

Annotated entities:
- Measurement: "MMSE"
- Value: "score ≥ 20"